Clinical trial exclusion criterion:
History of chronic alcohol consumption and/or drug abuse.

Entity relations:
- AND("History", "chronic alcohol consumption")
- OR("chronic alcohol consumption", "drug abuse")